Clinical trial exclusion criterion:
eGFR < 60ml/min/1.73m2

Entity relations:
- Has_value("eGFR", "< 60ml/min/1.73m2")